Clinical trial exclusion criterion:
Unable to undergo brain MRI

Annotated entities:
- Procedure: "brain MRI"
- Mood: "Unable to undergo"